Clinical trial exclusion criterion:
Major surgery within 4 weeks

Annotated entities:
- Procedure: "Major surgery"
- Temporal: "within 4 weeks"